Clinical trial inclusion criterion:
Clinical and radiographic evidence of FAI

Entity relations:
- Has_qualifier("FAI", "radiographic evidence")
- Has_qualifier("FAI", "Clinical evidence")